J. L. es un paciente que tiene que administrarse un fármaco por vía inhalatoria con un dispensador en forma de cartucho presurizado. La recomendación que le dará para su correcta administración será:
1. Coloque el inhalador a 6 cm por delante de la boca.
2. Realice una espiración lenta y profunda antes de la administración.
3. Sujete el cartucho con el pulgar arriba y el índice abajo.
4. Inicie la inspiración después de pulsar el inhalador.
5. No debe enjuagarse la boca después de la inhalación.

Respuesta correcta: 2. Realice una espiración lenta y profunda antes de la administración.